Previous intracranial bleeding

The above is a clinical trial exclusion criterion. Annotated with entity spans:
[Temporal: Previous] [Procedure: intracranial bleeding]